青春期少女的雌二醇（estradiol），主要源自：
A. 卵巢
B. 脂肪
C. 肝臟
D. 腎上腺

正確答案：A. 卵巢